Scheduled for closed reduction with percutaneous pinning under general anesthesia

The above is a clinical trial inclusion criterion. Annotated with entity spans:
[Mood: Scheduled for] [Procedure: closed reduction with percutaneous pinning] under [Procedure: general anesthesia]